Clinical trial inclusion criterion:
Prior surgery, including tumor resection or metastasectomy must have been performed at least 4 weeks prior to study enrollment.

Annotated entities:
- Procedure: "surgery"
- Temporal: "Prior"
- Procedure: "metastasectomy"
- Procedure: "tumor resection"
- Temporal: "at least 4 weeks prior to study enrollment"
- Reference_point: "study enrollment"